一位 67 歲的男性退休行政人員，家族史有肝癌，過去並無特殊疾病史，平常無運動習慣，不抽菸且 不喝酒。下列何項預防保健服務的建議，並無實證醫學的依據？
A. 貧血篩檢
B. 憂鬱症篩檢
C. 體重測量
D. 視力篩檢

正確答案：A. 貧血篩檢